Antibiotic prophylaxis within the last 6 months

The above is a clinical trial exclusion criterion. Annotated with entity spans:
[Procedure: Antibiotic prophylaxis] [Temporal: within the last 6 months]